Clinical trial exclusion criteria:
Known hypersensitivity to paracetamol or mannitol (excipient with known effect)
Severe hepatocellular insufficiency (ASAT or ALAT > 5N, or bilirubin > 2N)
Pharmacological intervention (administration of corticosteroids, NSAIDs or paracetamol) or physical intervention (external cooling technique) that may influence temperature in the last 6 hours.
Pregnant or breastfeeding women
Previous participation in this study

Annotated entities:
- Condition: "hypersensitivity"
- Drug: "paracetamol"
- Drug: "mannitol"
- Non-representable: "(excipient with known effect)"
- Condition: "hepatocellular insufficiency"
- Measurement: "ASAT"
- Measurement: "ALAT"
- Value: "> 5N"
- Measurement: "bilirubin"
- Value: "> 2N"
- Procedure: "Pharmacological intervention"
- Drug: "Pharmacological"
- Drug: "corticosteroids"
- Drug: "NSAIDs"
- Drug: "paracetamol"
- Procedure: "physical intervention"
- Procedure: "external cooling technique"
- Qualifier: "that may influence temperature"
- Temporal: "in the last 6 hours"
- Measurement: "temperature"
- Condition: "Pregnant"
- Observation: "breastfeeding"
- Person: "women"
- Competing_trial: "Previous participation in this study"